Clinical trial exclusion criterion:
Uncontrolled Diabetes [hemoglobin A1c, (HbA1c) >7.5%].

Annotated entities:
- Condition: "Diabetes"
- Qualifier: "Uncontrolled"
- Measurement: "hemoglobin A1c"
- Measurement: "HbA1c"
- Value: ">7.5%"